有關大腸憩室炎（diverticulitis disease）的敘述，下列何者錯誤？
A. 評估大腸憩室炎的嚴重程度，目前較建議的診斷工具是電腦斷層
B. 急性大腸憩室炎臨床上可粗略分為非複雜性及複雜性；非複雜性（uncomplicated）可以採保守治療方式
C. 可建議大腸憩室炎患者在症狀改善後的4～6週接受大腸鏡檢查，藉此確診大腸憩室及排除大腸惡性腫瘤或大腸發炎性疾病之可能性
D. 一旦患者發生過大腸憩室炎，就必須建議患者接受常規部分大腸切除，以預防下次大腸憩室炎的發作

正確答案：D. 一旦患者發生過大腸憩室炎，就必須建議患者接受常規部分大腸切除，以預防下次大腸憩室炎的發作